Clinical trial inclusion criterion:
HBsAg negative, HBcAb negative, HBsAb positive patients are eligible.

Entity relations:
- Has_value("HBsAg", "negative")
- Has_value("HBcAb", "negative")
- Has_value("HBsAb", "positive")